What is the function of the PDZ domain in SATB1?

The PDZ domain is a cytoplasmic protein domain found in histone H3 lysine 27 and it is essential for PDZ-mediated ubiquitination of SATB1.